Clinical trial exclusion criterion:
Patients with any other primary DSM-IV psychiatric diagnosis in addition to Obsessive Compulsive Disorder.

Annotated entities:
- Qualifier: "any other"
- Negation: "in addition to"
- Condition: "Obsessive Compulsive Disorder"
- Condition: "psychiatric diagnosis"
- Qualifier: "primary"
- Qualifier: "DSM-IV"